一位 56 歲女性患有糖尿病，因頻尿、左腹痛、發燒、畏寒 5 天而到門診求診，身體檢查左腰肋有觸碰疼痛，血壓 90/60 mmHg、心跳 100/min、呼吸 22/min，CBC呈現WBC 13,000/mm3，Neutrophil 86%，而尿液沈澱物鏡檢呈現WBC 80-100/HPF，RBC 2-4/HPF，請問診斷處理上，下列何者不適當？
A. 診斷為下尿道感染
B. 應做尿液培養
C. 可考慮做腹部超音波
D. 可考慮住院，並行血液培養

正確答案：A. 診斷為下尿道感染